Clinical trial inclusion criterion:
Histologic or cytologic diagnosis of stage IIIB/IV NSCLC

Annotated entities:
- Procedure: "Histologic"
- Procedure: "cytologic"
- Condition: "NSCLC"
- Qualifier: "stage IIIB/IV"